Clinical trial inclusion criteria:
Ultrasound confirmed complete mole

Annotated entities:
- Procedure: "Ultrasound"
- Condition: "complete mole"